Clinical trial exclusion criterion:
Patients with current diagnosis of primary cutaneous ALCL (patients whose ALCL has transformed to sALCL are eligible).

Annotated entities:
- Condition: "primary cutaneous ALCL"
- Condition: "sALCL"